Patients who have submitted a written consent to participate in the clinical trial

The above is a clinical trial inclusion criterion. Annotated with entity spans:
[Informed_consent: Patients who have submitted a written consent to participate in the clinical trial]